Clinical trial exclusion criterion:
Left bundle branch block or ventricular pacing

Annotated entities:
- Condition: "Left bundle branch block"
- Condition: "ventricular pacing"